ASA I and II women

The above is a clinical trial inclusion criterion. Annotated with entity spans:
[Measurement: ASA] [Value: I and II] [Person: women]